淋病（Gonorrhea）可以一再地感染同一個宿主的原因為何？
A. 免疫激發力（immunogenicity）低
B. 免疫激發力高
C. 毒性（virulence）低
D. 毒性高

正確答案：A. 免疫激發力（immunogenicity）低